Al cuidar a un paciente al que le han realizado una laringectomía supraglótica deberá tener en cuenta que:
1. Ha perdido la capacidad para hablar por extirpación de las cuerdas vocales verdaderas.
2. La traqueostomía que le han realizado será permanente.
3. Tiene riesgo de broncoaspiración por la dificultad para deglutir.
4. Puede presentar estreñimiento por la realización de una disección cervical.
5. Se ha extirpado una porción de la laringe junto con una cuerda vocal.

Respuesta correcta: 3. Tiene riesgo de broncoaspiración por la dificultad para deglutir.